下列何種感染症最不會造成末梢神經病變（peripheral neuropathy）？
A. B型肝炎（hepatitis B）
B. 愛滋病（AIDS）
C. 痲瘋病（leprosy）
D. 白喉病（diphtheria）

正確答案：A. B型肝炎（hepatitis B）